女性 78 歲胰臟癌病患，於昨天接受胰十二指腸切除手術，今天下午發燒至 38.4℃、呼吸較淺、腹部引流（drainage）為 80 c.c.血水（serosanguineous discharge），血壓為 130/86 mmHg。請問下列何者為優先考慮處置方式？
A. 急做腹部電腦斷層檢查
B. 緊急聯絡開刀房進行再剖腹手術止血
C. 請病人多咳痰及深呼吸，考慮照肺部 X 光
D. 立即給予類固醇退燒，並會診感染科醫師更換抗生素

正確答案：C. 請病人多咳痰及深呼吸，考慮照肺部 X 光